Clinical trial exclusion criterion:
Unwillingness or inability to comply with the procedures described in this protocol

Annotated entities:
- Post-eligibility: "Unwillingness or inability to comply with the procedures described in this protocol"